一位65歲老先生跌倒，造成右下肢骨折送醫，X光檢查發現兩側下肢長骨及鎖骨另有多處蝕骨（osteolytic）現象。腫瘤標記包括 PSA, CEA, SCC, AFP皆在正常範圍。以下檢查何者為診斷及分期所必要？①血液常規 ②血液球蛋白免疫電泳分析 ③腎功能 ④骨髓檢查
A. 僅①③
B. 僅②③④
C. 僅①②④
D. ①②③④

正確答案：D. ①②③④